Clinical trial exclusion criterion:
7. The subject has a concurrent chronic or acute illness, disability, or other condition (including significant unexpected laboratory or electrocardiogram [ECG] findings) that might confound the results of the tests and/or measurements administered in this study, or that might have increased the risk to the subject.

Annotated entities:
- Condition: "chronic illness"
- Condition: "acute illness"
- Condition: "disability"
- Condition: "other condition"
- Undefined_semantics: "The subject has a concurrent chronic or acute illness, disability, or other condition (including significant unexpected laboratory or electrocardiogram [ECG] findings) that might confound the results of the tests and/or measurements administered in this study, or that might have increased the risk to the subject."
- Procedure: "electrocardiogram [ECG]"
- Condition: "laboratory findings"
- Condition: "electrocardiogram [ECG] findings"